下列何者不符合行政院衛生署的傳染病通報方針？
A. 確診化
B. 專業化
C. 資訊化
D. 國際化

正確答案：A. 確診化